下列何種思覺失調症（schizophrenia）的治療藥物，與serotonin (5-HT2) receptor有高的親和力，較不會引起錐體外症候群（extrapyramidal symptoms），但有QT延⻑（QT prolongation）的風險？
A. ziprasidone
B. clozapine
C. chlorpromazine
D. haloperidol

正確答案：A. ziprasidone